Patients unable to consent

The above is a clinical trial exclusion criterion. Annotated with entity spans:
[Non-query-able: Patients unable to consent]